Clinical trial inclusion criterion:
Male and/or female patients from 30-80 years of age with a diagnosis of Type 2 diabetes (WHO criteria).

Entity relations:
- Has_value("of age", "30-80 years")